Una de las siguientes relaciones de coenzimas con grupos químicos transferidos NO es correcta:
1. Biocitina – CO2.
2. Coenzima A – grupos acilo.
3. Flavina adenina dinucleótido – electrones.
4. Tiamina pirofosfato – grupos amino.
5. Tetrahidrofolato – grupos monocarbonados.

Respuesta correcta: 4. Tiamina pirofosfato – grupos amino.